有關牛奶蛋白過敏，下列敘述何者錯誤？
A. 通常在一歲之後出現
B. 兒童隨	年齡的成長，症狀可能緩解
C. 屬於一種IgE抗體主導（IgE-mediated）的過敏反應
D. 對牛奶蛋白過敏的兒童，改用羊奶或羊奶嬰兒配方，並沒有預防過敏的效果

正確答案：A. 通常在一歲之後出現